Clinical trial exclusion criterion:
Presence or recent history of major depressive disorder, bipolar disorder, psychotic disorder, or generalized anxiety disorder requiring therapy.

Annotated entities:
- Temporal: "history"
- Condition: "major depressive disorder"
- Condition: "bipolar disorder"
- Condition: "psychotic disorder"
- Condition: "generalized anxiety disorder"
- Qualifier: "requiring therapy"